Clinical trial exclusion criterion:
Known HIV/AIDS.

Annotated entities:
- Condition: "Known HIV"
- Condition: "AIDS"